舟形頭（scaphocephaly）是因那一個骨縫先天性過早癒合所導致？
A. sagittal suture
B. lambdoid suture
C. coronal suture
D. metopic suture

正確答案：A. sagittal suture